Meet criteria for a current manic episode based on structured clinical interview

The above is a clinical trial exclusion criterion. Annotated with entity spans:
Meet criteria for a current [Condition: manic episode] based on structured clinical interview